Age < 20 or > 35 years.

The above is a clinical trial exclusion criterion. Annotated with entity spans:
[Person: Age] [Value: < 20] or [Value: > 35 years].